27歲初產婦，懷孕35週，至產房就診，主訴陰道出血與腹痛，血壓96/58 mmHg，無尿蛋白反應，腹部超音波無特殊發現，因胎心監視器（tococardiography）呈現延遲性胎心減速（late deceleration）現象，緊急施予剖腹生產，手術中發現，子宮表面呈藍色變化（Couvelaire uterus），同時合併子宮收縮不良及產後出血，是何種產科急症？
A. 胎盤剝離（placental abruption）
B. 植入性胎盤（placenta accreta）
C. 子宮破裂（uterine rupture）
D. 不明原因凝血功能異常（idiopathic coagulation disorder）

正確答案：A. 胎盤剝離（placental abruption）